Clinical trial inclusion criterion:
2. Patients with PHN must have had pain >3 months after rash healing

Entity relations:
- multi("after rash healing", "rash healing")
- multi("rash healing", "rash healing")
- Has_multiplier("pain", ">3 months")
- Has_temporal("pain", "after rash healing")
- AND("PHN", "pain")